En una unidad de hospitalización ingresan al año un 15% de personas mayores con demencia, gran parte de ellas en estadios muy avanzados. El dolor es un síntoma frecuente en este tipo de pacientes. Señale la respuesta correcta, en pacientes con demencia muy avanzada:
1. El dolor no tratado puede manifestarse por agitación.
2. La Escala Visual Analógica es la más apropiada para la valoración del dolor por su sencillez.
3. Las escalas subjetivas unidimensionales son las recomendadas por los expertos para evaluar el dolor.
4. No se dispone específicamente de escalas diseñadas para valorar el dolor.
5. La administración de opiáceos para el control del dolor está desaconsejada.

Respuesta correcta: 1. El dolor no tratado puede manifestarse por agitación.